Women age 18-45

The above is a clinical trial inclusion criterion. Annotated with entity spans:
[Person: Women] [Person: age] [Value: 18-45]